Patients who have a history of psychotropics abuse and can not quit, or who have mental disorders;

The above is a clinical trial exclusion criterion. Annotated with entity spans:
Patients who have a [Temporal: history] of [Drug: psychotropics] [Condition: abuse] [Non-representable: and can not quit], or who have [Condition: mental disorders];